What is an operon?

genes are contained in operons, multigene clusters controlled by a single promoter. s. An operon is a group of genes linked together in a linear fashion and producing a polycistronic mRNA.